Clinical trial exclusion criterion:
Highly frail patients whose estimated lifespan due to comorbidities by the judgement of the investigator is less than 6 months.

Entity relations:
- Has_temporal("lifespan", "less than 6 months")